patients included in another interventional clinical study involving infections or antibiotics and having the same primary parameter,

The above is a clinical trial exclusion criterion. Annotated with entity spans:
[Competing_trial: patients included in another interventional clinical study involving infections or antibiotics and having the same primary parameter],